WBC <3 K/cumm

The above is a clinical trial exclusion criterion. Annotated with entity spans:
[Measurement: WBC] [Value: <3 K/cumm]